Right proficient oral and written language.

The above is a clinical trial inclusion criterion. Annotated with entity spans:
[Post-eligibility: Right proficient oral and written language].